下列何項藥物可用以治療佩吉特氏病（Paget's disease）？
A. thyroxine
B. exenatide
C. calcitonin
D. rosiglitazone

正確答案：C. calcitonin